Clinical trial exclusion criterion:
long-term oxygen therapy

Annotated entities:
- Procedure: "long-term oxygen therapy"